Clinical trial exclusion criterion:
History of psychotic disorder or manic episode diagnosed by MINI-KID

Entity relations:
- Has_temporal("psychotic disorder", "History")
- AND("psychotic disorder", "MINI-KID")
- OR("psychotic disorder", "manic episode")